Clinical trial exclusion criterion:
Women with breast implants on the same side as the lesion

Annotated entities:
- Person: "Women"
- Device: "breast implants"
- Qualifier: "same side as the lesion"
- Reference_point: "the lesion"